Clinical trial inclusion criterion:
composite head and neck tumor resection

Annotated entities:
- Procedure: "composite head and neck tumor resection"